下列有關色素（pigments）的敘述，何者錯誤？
A. 皮膚刺青（tattoo）的色素是存在於表皮（epidermis）
B. 刺青色素（tattoo）通常不會引起炎症反應
C. 脂褐質（lipofuscin）並不會傷害細胞或影響它的功能
D. 脂褐質（lipofuscin）的出現是顯示游離基損傷（free radical injury）及脂質過氧化作用（peroxidation）

正確答案：A. 皮膚刺青（tattoo）的色素是存在於表皮（epidermis）